Subjects with a current DSM-<U+2163>-TR or 5 diagnosis other than schizophrenia, including schizoaffective disorder, major depressive disorder, bipolar disorder, delirium, dementia, amnesia, Borderline, Paranoid, Histrionic, Schizotypal, Schizoid, Antisocial or other cognitive or personality disorders.

The above is a clinical trial exclusion criterion. Annotated with entity spans:
Subjects with a current [Qualifier: DSM-<U+2163>-TR] or 5 diagnosis [Negation: other than] [Condition: schizophrenia], including [Condition: schizoaffective disorder], [Condition: major depressive disorder], [Condition: bipolar disorder], [Condition: delirium], [Condition: dementia], [Condition: amnesia], [Condition: Borderline], [Condition: Paranoid], [Condition: Histrionic], [Condition: Schizotypal], [Condition: Schizoid], [Condition: Antisocial] or [Qualifier: other] [Condition: cognitive] or [Condition: personality disorders].